ECOG=1 or if ECOG=2 but recover after pretreatment.

The above is a clinical trial inclusion criterion. Annotated with entity spans:
[Measurement: ECOG][Value: =1] or if [Measurement: ECOG][Value: =2] but [Condition: recover] [Temporal: after pretreatment].